下列何者是導致突變的Ras蛋白（Ras mutant）持續活化（constitutive activation）的主要原因？
A. 增加與GDP結合的親和力
B. 不受GTPase-activating proteins（GAP）的調節
C. 降低細胞膜受體與激素的結合能力
D. 增加細胞膜受體與G蛋白的結合能力

正確答案：B. 不受GTPase-activating proteins（GAP）的調節